Has had a thyroidectomy or active thyroid disease requiring medication during the last 12 months (not excluded: a stable thyroid supplementation)

The above is a clinical trial exclusion criterion. Annotated with entity spans:
Has had a [Procedure: thyroidectomy] or [Qualifier: active] [Condition: thyroid disease] requiring [Drug: medication] [Temporal: during the last 12 months] ([Negation: not excluded]: a [Qualifier: stable] [Drug: thyroid supplementation])